Concurrent malignancy (if in remission, at least 5 years disease free) except for localized (in-situ) disease, basal carcinomas and cutaneous squamous cell carcinomas that have been adequately treated

The above is a clinical trial exclusion criterion. Annotated with entity spans:
[Temporal: Concurrent] [Condition: malignancy] (if [Qualifier: in remission], [Value: at least 5 years] [Qualifier: disease free]) [Negation: except for] [Condition: localized (in-situ) disease], [Condition: basal carcinomas] and [Condition: cutaneous squamous cell carcinomas] that have been [Qualifier: adequately treated]